Receipt of blood or blood products 8 weeks prior to vaccination or planned administration during the three week study period following vaccination

The above is a clinical trial exclusion criterion. Annotated with entity spans:
[Procedure: Receipt of blood] or blood products [Temporal: 8 weeks prior to vaccination] or [Mood: planned administration] [Temporal: during the three week study period following vaccination]